Clinical trial exclusion criterion:
Plan to remove the tumor surgically before completing the protocol chemo/radiotherapy course

Entity relations:
- Has_temporal("Plan to remove the tumor surgically", "before completing the protocol chemo/radiotherapy course")